目前法律對於家屬代理決定權的優先順序並沒有一般性的規定，因此大多類推適用安寧緩和醫療條 例第七條的規定，其優先順序以下列何者為正確？
A. 配偶＞成人直系血親卑親屬＞父母＞兄弟姊妹
B. 配偶＞父母＞成人直系血親卑親屬＞兄弟姊妹
C. 成人直系血親卑親屬＞配偶＞父母＞兄弟姊妹
D. 成人直系血親卑親屬＞父母＞配偶＞兄弟姊妹

正確答案：A. 配偶＞成人直系血親卑親屬＞父母＞兄弟姊妹